Clinical trial exclusion criterion:
Patients with a life expectancy of less than 1 year

Annotated entities:
- Observation: "life expectancy"
- Value: "less than 1 year"